Clinical trial inclusion criterion:
37 weeks gestation or greater

Entity relations:
- Has_value("gestation", "37 weeks greater")